18 years of age

The above is a clinical trial inclusion criterion. Annotated with entity spans:
[Value: 18 years] of [Person: age]